Clinical trial inclusion criterion:
(1)= 45 years old;

Annotated entities:
- Value: "= 45 years"
- Person: "old"